Clinical trial exclusion criterion:
cognitive impairment (Mini-Mental Status Examination score: illiterate 13 points; elementary and middle school 18 points; and high-school 26 points; or inability to respond to verbal command);

Annotated entities:
- Condition: "cognitive impairment"
- Measurement: "Mini-Mental Status Examination score"
- Observation: "illiterate"
- Value: "13 points"
- Observation: "elementary"
- Observation: "middle school"
- Value: "18 points"
- Observation: "high-school"
- Value: "26 points"
- Condition: "inability to respond to verbal command"